Clinical trial exclusion criterion:
Active or recent drug or alcohol abuse

Entity relations:
- Has_temporal("drug abuse", "Active")
- OR("Active", "recent")
- OR("drug abuse", "alcohol abuse")